Patients with renal impairment (serum creatinine more than twice the upper limit of normal).

The above is a clinical trial exclusion criterion. Annotated with entity spans:
Patients with [Condition: renal impairment] ([Measurement: serum creatinine] [Value: more than twice the upper limit of normal]).